Clinical trial inclusion criterion:
provided written informed consent

Annotated entities:
- Informed_consent: "provided written informed consent"